一位 60 歲男性患有肺腫瘤，必須接受右肺切除手術。在手術中實行左側單肺呼吸（one-lung ventilation）一段時間後，血中含氧量（PaO2）下降，下列敘述何者錯誤？
A. 可調高呼吸速率，以增加肺部每分鐘換氣量
B. 可將吸入氧氣濃度 FiO2調成 100%
C. 可使用 5-10 cm H2O 之呼氣末期正壓（PEEP）至換氣肺側
D. 應利用高度換氣（Hyperventilation），使血中二氧化碳濃度（PaCO2）小於 30 mmHg

正確答案：D. 應利用高度換氣（Hyperventilation），使血中二氧化碳濃度（PaCO2）小於 30 mmHg